Patients with knee fusion to the affected joint

The above is a clinical trial exclusion criterion. Annotated with entity spans:
Patients with [Procedure: knee fusion] to the affected joint